La filtración renal de H2O ocurre en los capilares glomerulares y su reabsorción en los peritubulares, porque los primeros tienen mayor:
1. Permeabilidad.
2. Presión hidrostática.
3. Presión coloidosmótica.
4. Diámetro.

Respuesta correcta: 2. Presión hidrostática.